當考生正專注於國家考試試題時，額葉測得的腦波最可能是下列何者？
A. alpha rhythm
B. beta rhythm
C. theta rhythm
D. delta rhythm

正確答案：B. beta rhythm